Sever renal impairment (S. creatinine more than 3)

The above is a clinical trial exclusion criterion. Annotated with entity spans:
[Qualifier: Sever] [Condition: renal impairment] (S. [Measurement: creatinine] [Value: more than 3])